Clinical trial exclusion criterion:
Active bleeding or at high risk for bleeding.

Entity relations:
- Has_mood("bleeding", "at high risk for")
- Has_qualifier("bleeding", "Active")
- OR("bleeding", "bleeding")